Clinical trial exclusion criterion:
Patients unwilling to limit exposure to UV light

Annotated entities:
- Mood: "unwilling"
- Procedure: "limit exposure to UV light"